Be cognitively capable, in the opinion of investigator, to understand and provide such informed consent.

The above is a clinical trial inclusion criterion. Annotated with entity spans:
[Informed_consent: Be cognitively capable, in the opinion of investigator, to understand and provide such informed consent].